Patients who require a central venous line to receive PN or already have a central venous line in place for other reasons

The above is a clinical trial inclusion criterion. Annotated with entity spans:
Patients who require a [Device: central venous line] to receive [Procedure: PN] or already have a [Device: central venous line] in place for [Observation: other reasons]